1. Had a neurological condition other than that associated with their pain diagnosis which, in the opinion of the investigator, would interfere with their ability to participate in the study

The above is a clinical trial exclusion criterion. Annotated with entity spans:
1. Had a [Condition: neurological condition] [Negation: other than] that [Qualifier: associated with their pain diagnosis] which, [Undefined_semantics: in the opinion of the investigator], would interfere with their ability to participate in the study